Clinical trial exclusion criterion:
Abnormal coagulation profile: INR > 2.5 and/or PTT > 80

Entity relations:
- Has_value("coagulation profile", "Abnormal")
- Has_value("INR", "> 2.5")
- Has_value("PTT", "> 80")
- Subsumes("Abnormal coagulation profile", "INR")
- OR("INR", "PTT")